Obtained informed consent

The above is a clinical trial inclusion criterion. Annotated with entity spans:
[Post-eligibility: Obtained informed consent]